Treatment with GLP1 (glucagon-like peptide) analogue or insulin

The above is a clinical trial inclusion criterion. Annotated with entity spans:
[Procedure: Treatment] with [Drug: GLP1 (glucagon-like peptide) analogue] or [Drug: insulin]